comorbidities other than AF, which present an indication for anticoagulation;

The above is a clinical trial exclusion criterion. Annotated with entity spans:
[Condition: comorbidities] [Negation: other than] [Condition: AF], which present an [Condition: indication] for [Procedure: anticoagulation];